Clinical trial exclusion criterion:
History of ischaemic heart disease, cardiac failure, cerebrovascular disease, liver impairment (ALT/AST>50IU/L) or stage 3-5 chronic kidney disease.

Entity relations:
- Has_value("AST", ">50IU/L")
- Has_value("ALT", ">50IU/L")
- Has_value("stage", "3-5")
- AND("chronic kidney disease", "stage")
- Subsumes("liver impairment", "ALT")
- OR("ALT", "AST")
- OR("ischaemic heart disease", "cardiac failure", "cerebrovascular disease", "liver impairment", "stage")